關於levetiracetam為部分癲癇發作（partial seizure）治療藥物，下列敘述何者錯誤？
A. 可經由口服給藥
B. 選擇性的結合突觸小泡蛋白SV2A
C. 影響神經傳遞物質如glutamate和GABA的釋放
D. 主要經由肝臟代謝

正確答案：D. 主要經由肝臟代謝